What is the function of the Eyeless associated gene in Drosophila?

Theeye-associated Pax6 gene controls neuronal navigation in Drosophila.